Residing in the Manya Krobo or Yilo Krobo district

The above is a clinical trial inclusion criterion. Annotated with entity spans:
[Observation: Residing] in the [Visit: Manya Krobo] or [Visit: Yilo Krobo district]